Which is the master oncogenic transcription factor in T-cell acute lymphoblastic leukemia?

The oncogenic transcription factor TAL1/SCL induces an aberrant transcriptional program in T-cell Acute lymphoblastic Leukemia (T-ALL) cells. It's not the master transcription factor, it's the oncogene.